Clinical trial exclusion criterion:
History of intolerance to ARB or amlodipine.

Entity relations:
- AND("intolerance", "ARB")
- OR("ARB", "amlodipine")